Clinical trial inclusion criterion:
primary total knee replacement surgery

Annotated entities:
- Procedure: "total knee replacement surgery"
- Qualifier: "primary"